有關細胞激素的功能，下列敘述何者錯誤？
A. 調節性T細胞（regulatory T cell）可以分泌TGF-β來抑制效應性T細胞（effector T cell）之功能
B. IL-6與TGF-β可以幫助CD4+ T細胞分化變成第十七型輔助性T細胞（TH17）
C. IL-17主要的功能為吸引嗜酸性白血球
D. IL-4與IL-5主要由第二型輔助性T細胞（TH2）分泌而來，可以一起幫助B細胞產生IgE抗體

正確答案：C. IL-17主要的功能為吸引嗜酸性白血球